diabetes

The above is a clinical trial exclusion criterion. Annotated with entity spans:
[Condition: diabetes]